non-genotype 4

The above is a clinical trial exclusion criterion. Annotated with entity spans:
[Negation: non]-[Condition: genotype 4]